Clinical trial exclusion criterion:
Serum creatinine level = 3.0 mg/dL

Annotated entities:
- Measurement: "Serum creatinine level"
- Value: "= 3.0 mg/dL"